Signed informed consent;

The above is a clinical trial inclusion criterion. Annotated with entity spans:
[Non-query-able: Signed informed consent;]